OR any FEV1 with chronic hypercapnia (baseline partial pressure of arterial carbon dioxide [PaCO2] > 45)

The above is a clinical trial inclusion criterion. Annotated with entity spans:
[Non-query-able: OR any FEV1] with [Condition: chronic hypercapnia] (baseline [Measurement: partial pressure of arterial carbon dioxide] [[Measurement: PaCO2]] [Value: > 45])